Clinical trial exclusion criterion:
Patients with orthopedic or neuromuscular disorders that preclude participation in exercise.

Annotated entities:
- Condition: "neuromuscular disorders"
- Condition: "disorders orthopedic"